La espectrometría de masas se combina con la cromatografía para generar una herramienta analítica muy poderosa. En lo que se refiere a este acoplamiento se puede decir que:
1. Tanto la cromatografía de gases como la espectrometría de masas operan a alto vacío por lo que el acoplamiento es sencillo.
2. La espectrometría de masas opera con flujos de ml/min mientras que en HPLC se utilizan flujos muy bajos, del orden de nl/min.
3. El tiempo de barrido en el infrarrojo cuando se introducen en el espectrómetro de masas gases de elevada volatilidad se reduce considerablemente.
4. La cromatografía de líquidos trabaja a alta presión y temperatura próxima a la ambiente, mientras que la espectrometría de masas opera con gases a alto vacío y a elevada temperatura.

Respuesta correcta: 4. La cromatografía de líquidos trabaja a alta presión y temperatura próxima a la ambiente, mientras que la espectrometría de masas opera con gases a alto vacío y a elevada temperatura.